Clinical trial inclusion criterion:
2. C5 to T12 spinal cord injury, classified as ISNCSCI grades C and D

Entity relations:
- Has_qualifier("spinal cord injury", "C5 to T12")
- Has_value("ISNCSCI", "grades C and D")
- AND("spinal cord injury", "ISNCSCI")